Clinical trial exclusion criterion:
Treatment is not with the intent to cure the infection (that is, palliative care is an exclusion).

Annotated entities:
- Non-query-able: "Treatment is not with the intent to cure the infection (that is, palliative care is an exclusion)"